Clinical trial exclusion criterion:
Known history of angioedema.

Annotated entities:
- Condition: "angioedema"
- Temporal: "history"